Clinical trial exclusion criterion:
internal, neurologic or psychiatric disease that interfere with protocol compliance including current heavy smoking (>20 cigarettes per day), inability to perform 6 min walk test.

Annotated entities:
- Condition: "psychiatric disease"
- Condition: "neurologic disease"
- Condition: "internal disease"
- Observation: "smoking"
- Qualifier: "heavy"
- Multiplier: ">20 cigarettes per day"
- Negation: "inability"
- Procedure: "6 min walk test"